Clinical trial inclusion criterion:
Newly-diagnosed or recurrent (local, regional, metastatic) malignant melanoma or breast cancer patients in whom SLN mapping is indicated

Annotated entities:
- Condition: "malignant melanoma"
- Condition: "breast cancer"
- Qualifier: "local"
- Qualifier: "regional"
- Qualifier: "metastatic"
- Temporal: "Newly-diagnosed"
- Multiplier: "recurrent"